How is mTORC1 involved in the regulation of heat stress?

mTORC1 attenuates stress response by inhibiting cap-independent Hsp70 translation.